Have abnormal results for the following laboratory tests: serum 25(OH)D; serum creatinine; serum calcium; PTH; TSH

The above is a clinical trial exclusion criterion. Annotated with entity spans:
Have [Value: abnormal results] for the following laboratory tests: [Measurement: serum 25(OH)D]; [Measurement: serum creatinine]; [Measurement: serum calcium]; [Measurement: PTH]; [Measurement: TSH]